Clinical trial exclusion criterion:
Inflammation or infection at the study site

Entity relations:
- Has_qualifier("Inflammation", "study site")
- OR("Inflammation", "infection")